Clinical trial exclusion criterion:
Type 1 diabetes (autoantibody positive).

Annotated entities:
- Condition: "Type 1 diabetes"
- Measurement: "autoantibody"
- Value: "positive"